相似測	（similarity testing）及成語測	最常用來檢測：
A. 記憶力（memory）
B. 抽象思考（abstract thinking）
C. 判斷力（judgment）
D. 定向力（orientation）

正確答案：B. 抽象思考（abstract thinking）